Clinical trial exclusion criteria:
History of other significant skin disease, or skin manifestations of allergic illness or other dermatologic condition, except chronic moderate or severe atopic dermatitis, that would interfere with the trial assessments or compromise the patient's safety according to the opinion of the Investigator
Present symptoms of other skin diseases, except chronic atopic dermatitis, that could disturb the study assessment and evaluation of the skin
Current use of any active systemic medication for chronic atopic dermatitis within one month
Current use of active topical medication in the planned investigational area for chronic atopic dermatitis within two weeks
History of a sunny holiday, UV-light therapy or solarium use within one month before beginning of study treatments, or planning such during the study or within 7 days after the study
Allergy to cis-UCA, or any constituents of the placebo emulsion cream or any constituents of Protopic® ointment
History of any skin-related cancer
Congenital or acquired immunodeficiency or ongoing therapy that cause immunosuppression
Earlier participation in a clinical study performed with cis-UCA
Any clinically significant laboratory test result
Suspected current drug or alcohol abuse
Clinically significant illness during the 4 weeks prior to the first dose administration
Any other condition that in the opinion of the Investigator would interfere with the evaluation of the study results or constitute a health hazard for the patient
Unwillingness or doubtful capacity to comply with the protocol
Doubtful availability to complete the study

Annotated entities:
- Condition: "skin disease"
- Qualifier: "significant"
- Temporal: "History"
- Condition: "allergic illness"
- Condition: "dermatologic condition"
- Condition: "skin manifestations"
- Condition: "atopic dermatitis"
- Qualifier: "severe"
- Qualifier: "chronic moderate"
- Subjective_judgement: "would interfere with the trial assessments or compromise the patient's safety according to the opinion of the Investigator"
- Negation: "except"
- Condition: "skin diseases"
- Condition: "chronic atopic dermatitis"
- Negation: "except"
- Qualifier: "could disturb the study assessment and evaluation of the skin"
- Undefined_semantics: "could disturb the study assessment and evaluation of the skin"
- Condition: "chronic atopic dermatitis"
- Temporal: "within one month"
- Drug: "systemic medication"
- Temporal: "active"
- Condition: "chronic atopic dermatitis"
- Temporal: "within two weeks"
- Drug: "topical medication"
- Temporal: "active"
- Observation: "sunny holiday"
- Procedure: "UV-light therapy"
- Observation: "solarium use"
- Temporal: "within one month before beginning of study treatments"
- Reference_point: "beginning of study treatments"
- Mood: "planning"
- Temporal: "during the study"
- Temporal: "within 7 days after the study"
- Condition: "Allergy"
- Drug: "Protopic® ointment"
- Drug: "cis-UCA"
- Drug: "placebo emulsion cream"
- Condition: "skin-related cancer"
- Temporal: "History"
- Condition: "acquired immunodeficiency"
- Condition: "immunodeficiency Congenital"
- Procedure: "therapy that cause immunosuppression"
- Qualifier: "that cause immunosuppression"
- Condition: "immunosuppression"
- Temporal: "ongoing"
- Non-query-able: "Earlier participation in a clinical study performed with cis-UCA"
- Qualifier: "clinically significant"
- Procedure: "laboratory test"
- Undefined_semantics: "Any clinically significant laboratory test result"
- Subjective_judgement: "Any clinically significant laboratory test result"
- Condition: "alcohol abuse"
- Condition: "drug abuse"
- Observation: "Suspected"
- Temporal: "current"
- Temporal: "during the 4 weeks prior to the first dose administration"
- Reference_point: "the first dose administration"
- Condition: "illness"
- Qualifier: "Clinically significant"
- Subjective_judgement: "Clinically significant illness during the 4 weeks prior to the first dose administration"
- Post-eligibility: "Any other condition that in the opinion of the Investigator would interfere with the evaluation of the study results or constitute a health hazard for the patient"
- Post-eligibility: "Unwillingness or doubtful capacity to comply with the protocol"
- Post-eligibility: "Doubtful availability to complete the study"